What is another name for  keratomileusis?

['Report the outcomes of laser in situ keratomileusis (LASIK) for high myopia correction after long-term follow-up.']